Clinical trial exclusion criterion:
Platelets <100 K/cumm

Annotated entities:
- Measurement: "Platelets"
- Value: "<100 K/cumm"